What disease does BCG immunotherapy used to treat?

Bacillus Calmette-Guérin (BCG) immunotherapy is used for treatment of bladder cancer.